no previously demonstrated clinically significant allergy or hypersensitivity to any of the excipients of the investigational medication administered in this trial

The above is a clinical trial exclusion criterion. Annotated with entity spans:
no [Temporal: previously] demonstrated [Qualifier: clinically significant] [Condition: allergy] or [Condition: hypersensitivity] to any of the [Drug: excipients of the investigational medication] administered in this trial